Clinical trial exclusion criterion:
Acute grief (< 1 month)

Annotated entities:
- Condition: "Acute grief"
- Temporal: "< 1 month"